¿Qué trastorno está caracterizado por un sentimiento persistente y recurrente de estar separado de los propios procesos mentales o del cuerpo?:
1. Trastorno por despersonalización.
2. Trastorno de identidad disociativa.
3. Trastorno de personalidad múltiple.
4. La amnesia disociativa.

Respuesta correcta: 1. Trastorno por despersonalización.